diagnosis with mantle cell lymphoma

The above is a clinical trial inclusion criterion. Annotated with entity spans:
diagnosis with [Condition: mantle cell lymphoma]